有關骨科手術中麻醉的敘述，下列何者正確？①薦神經（sciatic nerve）和股神經（femoral nerve）阻斷術對膝蓋以下的手術是足夠的 ②肩關節手術常採取坐姿，常因感壓反射（baroreflex）導致心跳過慢、血壓過低 ③骨盆（pelvic）和股骨手術常會有脂肪栓塞（fat emboli），但產生嚴重脂肪栓塞症候群的機率小於百分之一 ④脊髓麻醉（spinal anesthesia）或硬脊膜外麻醉（epidural anesthesia）對全髖關節置換術（total hip replacement）都是適當的，但仍需監測失血量
A. ①③④
B. ①②④
C. ①②③
D. ②③④

正確答案：A. ①③④